Able to complete precision grips with both hands

The above is a clinical trial inclusion criterion. Annotated with entity spans:
[Mood: Able to] [Procedure: complete precision grips with both hands]